Clinical trial inclusion criterion:
Weight >5kg

Entity relations:
- Has_value("Weight", ">5kg")